Clinical trial exclusion criterion:
Anticoagulant use (warfarin or heparin)

Entity relations:
- Subsumes("Anticoagulant", "warfarin")
- OR("warfarin", "heparin")